Clinical trial inclusion criterion:
Production of sputum

Annotated entities:
- Condition: "sputum"